Which genes are associated with Epidermolysis Bullosa Simplex?

Keratin 5 and keratin 14 are known to be essential for the basal keratinocyte cytoskeleton and are defective in several forms of epidermolysis bullosa simplex. Homozygous deletion mutations in the plectin gene in patients with epidermolysis bullosa simplex associated with late-onset muscular dystrophy. The KRT5 and KRT14 genes encode the proteins keratin 5 and 14, respectively, which are the primary structural components of the 10-nm intermediate filaments of the mitotic epidermal basal cells. Epidermolysis bullosa simplex is mainly caused by mutations in the KRT5 and KRT14 genes. Verrucous carcinoma in epidermolysis bullosa simplex is possibly associated with a novel mutation in the keratin 5 gene. This is the first report of EBS-generalized intermediate in a newborn with de novo KRT5 gene mutation and KRT14 gene polymorphism, and no familial history of epidermolysis. Study of a family with epidermolysis bullosa simplex resulting from a novel mutation of KRT14 gene. We have systematically scanned genomic sequences of one of these keratins, keratin 14, for mutations in patients from 49 apparently independent kindreds using single-strand conformation polymorphism analysis.